肌萎縮性側索硬化（Amyotrophic lateral sclerosis, ALS）不會產生下列那個症狀？
A. Sensory loss
B. Dysphagia
C. Fasciculation
D. Babinski sign

正確答案：A. Sensory loss